Clinical trial inclusion criterion:
Subjects have no history of the following: ongoing acute or intermittent pain, postoperative pain, respiratory compromise, acute or severe asthma, or constipation (less than 1 bowel movement every 2 days)

Annotated entities:
- Condition: "pain"
- Qualifier: "acute"
- Qualifier: "intermittent"
- Condition: "pain"
- Qualifier: "postoperative"
- Condition: "respiratory compromise"
- Condition: "asthma"
- Qualifier: "acute"
- Qualifier: "severe"
- Negation: "no"
- Condition: "constipation"